Methadone-maintained cocaine-dependent patients use between 1g to 2g a day; 1 to 3 times a week

The above is a clinical trial inclusion criterion. Annotated with entity spans:
[Qualifier: Methadone-maintained] [Condition: cocaine-dependent] patients use between [Multiplier: 1g to 2g a day]; [Multiplier: 1 to 3 times a week]